Clinical trial inclusion criteria:
aged 18 or older,
have undergone oro-tracheal intubation for a coma (Glasgow Coma Score below or equal to 8),
with mechanical ventilation initiated in the first 48 hours following hospital admission

Annotated entities:
- Person: "aged"
- Value: "18 or older"
- Procedure: "oro-tracheal intubation"
- Condition: "coma"
- Measurement: "Glasgow Coma Score"
- Value: "below or equal to 8)"
- Procedure: "mechanical ventilation"
- Temporal: "first 48 hours following hospital admission"
- Reference_point: "hospital admission"